小芳是位 34 週大的女性早產兒，出生以後第二週開始產生呼吸暫停（apnea），餵奶進食量開始變差。醫師懷疑是菌血症（neonatal sepsis），為她作血液細菌培養並給予抗生素治療。血液電解質檢查Na+值為 138 mEq/L，K+值為 5.8 mEq/L，血糖及血壓均正常。新生兒篩檢中心通知小芳出生後滿 48 小時所做的新生兒血片篩檢有一項 17-OH progesterone值為 17 ng/mL（正常新生兒值為< 12 ng/mL）。 小芳為生殖器外觀正常之女生。此時最適宜的檢查為：
A. 進行 ACTH 刺激測試
B. 轉診到治療中心做確認診斷
C. 採足跟血作第二次的複檢
D. 檢查 21-hydoxylase 基因有無突變

正確答案：C. 採足跟血作第二次的複檢